Clinical trial exclusion criterion:
Is a nursing or pregnant female, or intends to become pregnant within 6 months after receiving trial medication

Annotated entities:
- Condition: "nursing"
- Condition: "pregnant"
- Person: "female"
- Condition: "pregnant"
- Temporal: "within 6 months after receiving trial medication"
- Mood: "intends to become"